gastrointestinal problems or musculoskeletal disorders that would prevent them to follow the test diets or exercise interventions

The above is a clinical trial exclusion criterion. Annotated with entity spans:
[Condition: gastrointestinal problems] or [Condition: musculoskeletal disorders] that would [Mood: prevent] them to follow the [Procedure: test diets] or [Procedure: exercise interventions]